Tuberculosis

The above is a clinical trial exclusion criterion. Annotated with entity spans:
[Condition: Tuberculosis]